¿Cómo se regula la actividad de la enzima aspartato transcarbamilasa?:
1. Mediante inhibición por CTP, citidín trifosfato, el producto final de la vía que inicia esta enzima.
2. Mediante fosforilación-defosforilación.
3. Mediante activación proteolítica.
4. Mediante isoenzimas.

Respuesta correcta: 1. Mediante inhibición por CTP, citidín trifosfato, el producto final de la vía que inicia esta enzima.